¿Qué parasomnia es más frecuente en la infancia?:
1. Terrores nocturnos.
2. Pesadillas.
3. Trastorno de conducta del sueño REM.
4. Síndrome de las piernas inquietas.
5. Sonambulismo.

Respuesta correcta: 2. Pesadillas.